Which disease is associated with DNAJB1-PRKACA fusion gene?

Fibrolamellar carcinoma is distinctive at clinical and histologic levels. A novel DNAJB1-PRKACA fusion gene characterizes almost all cases.